正常年輕男性直立姿勢時，心尖（apex）之體表投影位置，最有可能在：
A. 第四肋間鎖骨中線外側
B. 左側乳頭處
C. 第六肋間前腋線外側
D. 第五肋間鎖骨中線內側

正確答案：D. 第五肋間鎖骨中線內側